Met MGH transplant center criteria, listed for liver transplant

The above is a clinical trial inclusion criterion. Annotated with entity spans:
Met [Qualifier: MGH transplant center criteria], listed for [Procedure: liver transplant]